Clinical trial exclusion criterion:
Patients with heart failure.

Annotated entities:
- Condition: "heart failure"